Clinical trial inclusion criterion:
HBeAg negative within six months prior to initiation of peginterferon alfa-2a

Entity relations:
- multi("initiation of peginterferon alfa-2a", "peginterferon alfa-2a")
- Has_index("within six months prior to initiation of peginterferon alfa-2a", "initiation of peginterferon alfa-2a")
- Has_value("HBeAg", "negative")
- Has_temporal("HBeAg", "within six months prior to initiation of peginterferon alfa-2a")